Clinical trial exclusion criterion:
History of severe or multiple allergies

Entity relations:
- Has_qualifier("allergies", "severe")
- Has_temporal("allergies", "History")
- OR("severe", "multiple")